Computerised Tomography (CT) scan of chest and abdomen within 28 days of starting pembrolizumab.

The above is a clinical trial inclusion criterion. Annotated with entity spans:
[Procedure: Computerised Tomography (CT) scan of chest and abdomen] [Temporal: within 28 days of starting pembrolizumab].